Clinical trial exclusion criterion:
Allergy to any of proposed medications

Annotated entities:
- Condition: "Allergy"
- Drug: "proposed medications"